Clinical trial exclusion criterion:
Unable or unwilling to provide informed consent.

Annotated entities:
- Informed_consent: "Unable or unwilling to provide informed consent"